Clinical trial inclusion criterion:
absence of peritoneal carcinomatosis, central nervous system o bone metastasis.

Annotated entities:
- Condition: "peritoneal carcinomatosis"
- Negation: "absence"
- Condition: "central nervous system metastasis"
- Condition: "bone metastasis"